Current wheeze

The above is a clinical trial exclusion criterion. Annotated with entity spans:
Current [Condition: wheeze]